A significant risk of suicide corroborated by a score of =5 on item 10(suicidal thoughts) on the MADRS scale or by clinical judgment of the investigator

The above is a clinical trial exclusion criterion. Annotated with entity spans:
A [Qualifier: significant] [Observation: risk of suicide] corroborated by a [Value: score of =5 on item 10](suicidal thoughts) on the [Measurement: MADRS scale] or [Non-query-able: by clinical judgment of the investigator]